低血鈉的鑑別診斷，下列那一項最不適當？
A. 甲狀腺功能低下可能造成等容積型低血鈉症（euvolemic hyponatremia）
B. 低容積（hypovolemia）會使血液中的加壓素（vasopressin）增加
C. 心衰竭造成的高容積型低血鈉症（hypervolemic hyponatremia）其尿液中的鈉濃度通常大於 20 mM
D. 燒傷可能造成尿液中鈉濃度低於 20 mM的低容積型低血鈉

正確答案：C. 心衰竭造成的高容積型低血鈉症（hypervolemic hyponatremia）其尿液中的鈉濃度通常大於 20 mM